Clinical trial exclusion criteria:
Patients who have taken either morphine with daily dose more than 120mg or Fentanyl with daily dose more than 50ug/hr
Patients with significant abnormalities in hepatic or renal function which would, in the opinion of the investigator, prevent the patients involvement in the study
Patients with significant clinical abnormalities in CNS, respiratory or cardiovascular function, which in the investigators judgement prevents participation in the study
Patients who have taken antidepressants or anti-epileptic drugs, sedative hypnotics, selective serotonin reuptake inhibitor, short-acting analgesics, topical medications and anesthetics and/or muscle relaxants when taking Tramadol/Acetaminophen

Annotated entities:
- Drug: "morphine"
- Multiplier: "daily dose more than 120mg"
- Drug: "Fentanyl"
- Multiplier: "daily dose more than 50ug/hr"
- Condition: "abnormalities in hepatic function"
- Condition: "abnormalities in renal function"
- Condition: "abnormalities in CNS"
- Condition: "abnormalities in cardiovascular function"
- Condition: "abnormalities in respiratory function"
- Drug: "antidepressants"
- Drug: "anti-epileptic drugs"
- Drug: "sedative hypnotics"
- Drug: "selective serotonin reuptake inhibitor"
- Drug: "short-acting analgesics"
- Drug: "topical medications"
- Drug: "anesthetics"
- Drug: "muscle relaxants"
- Drug: "Tramadol"
- Drug: "Acetaminophen"
- Temporal: "when taking Tramadol/Acetaminophen"
- Reference_point: "taking Tramadol/Acetaminophen"